Es una enfermedad con herencia autosómica recesiva:
1. Alcaptonuria.
2. Hipercolesteronemia familiar.
3. Corea de Huntington.
4. Síndrome de Crouzon.

Respuesta correcta: 1. Alcaptonuria.